內側弓狀韌帶（medial arcuate ligament）是下列何結構間的纖維？
A. 左、右橫膈腳（crura）
B. 橫膈與腰大肌（psoas major）
C. 橫膈與腰方肌（quadratus lumborum）
D. 橫膈與骼肌（iliacus）

正確答案：B. 橫膈與腰大肌（psoas major）